Clinical trial exclusion criterion:
Has a known history of human immunodeficiency virus (HIV)

Annotated entities:
- Condition: "human immunodeficiency virus (HIV)"
- Temporal: "history"